Clinical trial exclusion criterion:
Positive Antigen HBs in the screening evaluation;

Annotated entities:
- Measurement: "Antigen HBs"
- Value: "Positive"
- Temporal: "in the screening evaluation"
- Reference_point: "screening evaluation"